一位 27 歲工人，因從高處跌下造成右跟骨骨折，X 光檢查及電腦斷層（CT scans）顯示跟骨斷成 3 塊且移位，跟骨後關節面被壓陷，這位病人該怎麼治療？
A. 手術復位及內固定
B. 作關節固定術
C. 抬高，作關節運動，不負重 2 至 3 個月
D. 徒手復位及經皮下鋼針固定（closed reduction and percutaneous pinning）

正確答案：A. 手術復位及內固定